previous Helicobacter Pylori eradication treatment

The above is a clinical trial exclusion criterion. Annotated with entity spans:
previous [Procedure: Helicobacter Pylori eradication treatment]